A previous adequate trial of topiramate

The above is a clinical trial exclusion criterion. Annotated with entity spans:
A [Temporal: previous] adequate trial of [Drug: topiramate]